compensated liver disease.

The above is a clinical trial inclusion criterion. Annotated with entity spans:
[Qualifier: compensated] [Condition: liver disease].